精子在下列那一器官中成熟並貯存？
A. 精囊（seminal vesicle）
B. 副睪管（ductus epididymis）
C. 細精管（seminiferous tubules）
D. 前列腺（prostate gland）

正確答案：B. 副睪管（ductus epididymis）